Clinical trial exclusion criterion:
For subjects enrolled at Russian sites: Acute disease of any severity on the day of vaccination or febrile illness (axillary temperature ≥ 37.0°C).

Entity relations:
- Has_index("on the day of vaccination", "the day of vaccination")
- Has_value("axillary temperature", "≥ 37.0°C")
- Subsumes("febrile illness", "axillary temperature")
- Has_temporal("Acute disease", "on the day of vaccination")
- AND("Russian sites", "Acute disease")
- AND("Russian sites", "febrile illness")